Clinical trial inclusion criterion:
If cirrhosis, Child A score with total bilirubin less than 30 micromoles per liter

Entity relations:
- Has_value("Child score", "A")
- Has_value("total bilirubin", "less than 30 micromoles per liter")
- AND("cirrhosis", "Child score")
- AND("cirrhosis", "total bilirubin")